Acute critical limb ischemia

The above is a clinical trial exclusion criterion. Annotated with entity spans:
[Temporal: Acute] [Qualifier: critical] [Condition: limb ischemia]